Malignant cancer(s)

The above is a clinical trial exclusion criterion. Annotated with entity spans:
[Condition: Malignant cancer](s)